子宮頸癌病人接受手術後，下列何者不是接受手術後放射線治療的適應症？
A. 數個淋巴腺轉移
B. 侵犯子宮頸旁組織（paracervical tissue）
C. positive surgical margins
D. 子宮頸腫瘤2 cm

正確答案：D. 子宮頸腫瘤2 cm